Clinical trial inclusion criterion:
Patients with 7.0% = HbA1c = 11.0% at the screening visit

Entity relations:
- Has_index("at the screening visit", "screening")
- Has_value("HbA1c", "7.0% 11.0%")
- Has_temporal("HbA1c", "at the screening visit")